severe gastroparesis requiring endoscopic placement of capsule

The above is a clinical trial exclusion criterion. Annotated with entity spans:
[Qualifier: severe] [Condition: gastroparesis] [Mood: requiring] [Procedure: endoscopic placement] of [Device: capsule]